Which micro-RNAs have been associated in the pathogenesis of Rheumatoid Arthritis?

Different expression patterns of mir-146a, miRNA-155, miRNA-124a, mir-203, mir-223, mir-346, mir-132, mir-363, mir-498, mir-15a, and mir-16 were documented in several tissue sample types of RA patients.